Clinical trial inclusion criteria:
Axial spondyloarthritis (ASAS criteria) and radiologic sacroiliitis as detected either by MRI or X-ray.

Annotated entities:
- Condition: "Axial spondyloarthritis"
- Qualifier: "ASAS criteria"
- Procedure: "radiologic"
- Condition: "sacroiliitis"
- Procedure: "MRI"
- Procedure: "X-ray"